Unable to consent.

The above is a clinical trial exclusion criterion. Annotated with entity spans:
[Observation: Unable to consent.]